Which drugs are included in the Lonsurf combination pill?

Lonsurf is an oral fixed dose combination of trifluridine and tipiracil that is used for cancer treatment.